Clinical trial exclusion criterion:
Pregnant or lactating female

Annotated entities:
- Condition: "Pregnant"
- Condition: "lactating"
- Person: "female"